Clinical trial exclusion criterion:
pregnant or nursing patients

Annotated entities:
- Pregnancy_considerations: "pregnant or nursing patients"